保護病人隱私是由來已久的醫學倫理傳統，但在例外的情形下，醫師有主動通報的義務。依照我國醫療法規 定，醫師遇有下列那些情形，應該主動向主管機關通報？①病人可能是受虐兒童 ②病人可能罹患法定傳染
 病 ③病人可能涉及保險詐欺 ④病人可能是警政機關通緝的犯人
A. 僅①③④
B. 僅①②④
C. 僅①②
D. 僅②

正確答案：C. 僅①②